Para el tratamiento psicológico de niños con Déficit de Atención e Hipersensibilidad (TDAH) se incluye la técnica de restituir los efectos de conducta adaptada, lo que se conoce como:
1. Coste de respuesta.
2. Resolución de problemas.
3. Autorregulación.
4. Sobrecorrección.

Respuesta correcta: 4. Sobrecorrección.